Clinical trial exclusion criteria:
Women under the age of 18,
Clinically positive axillary nodes
Neoadjuvant therapy for current breast cancer diagnosis
Women with previous SLNBx or axillary node dissection
Pregnant women
Women with previous radiation above the diaphragm, and below the neck

Annotated entities:
- Person: "Women"
- Person: "age"
- Value: "18 under"
- Condition: "axillary nodes"
- Qualifier: "positive"
- Procedure: "Neoadjuvant therapy"
- Condition: "breast cancer"
- Person: "Women"
- Procedure: "SLNBx"
- Procedure: "axillary node dissection"
- Qualifier: "previous"
- Pregnancy_considerations: "Pregnant women"
- Procedure: "radiation"
- Qualifier: "above the diaphragm"
- Qualifier: "below the neck"
- Qualifier: "previous"
- Person: "Women"